El tipo de epistasia que explica la proporción fenotípica dihíbrida 15:1 es la:
1. Doble dominante.
2. Simple recesiva.
3. Doble dominante recesiva.
4. Doble recesiva.
5. Simple dominante.

Respuesta correcta: 1. Doble dominante.